Clinical trial exclusion criterion:
Esophageal varices observed in endoscopy,

Annotated entities:
- Condition: "Esophageal varices"
- Procedure: "endoscopy"